Clinical trial inclusion criterion:
Global myocardial perfusion reserve (MPR) index < 2.5

Annotated entities:
- Measurement: "Global myocardial perfusion reserve (MPR) index"
- Value: "< 2.5"